Clinical trial inclusion criterion:
A medication for apathy is appropriate, in the opinion of the study physician

Annotated entities:
- Drug: "medication for apathy"
- Condition: "apathy"
- Post-eligibility: "A medication for apathy is appropriate, in the opinion of the study physician"
- Parsing_Error: "A medication for apathy is appropriate, in the opinion of the study physician"